Breast Carcinoma

The above is a clinical trial exclusion criterion. Annotated with entity spans:
[Condition: Breast Carcinoma]